Clinical trial exclusion criterion:
Patient unable to receive either propofol or isoflurane due to allergy or other specific contraindication.

Entity relations:
- AND("unable to receive", "propofol")
- AND("unable to receive", "allergy")
- OR("propofol", "isoflurane")